Clinical trial inclusion criterion:
Satisfying the 1987 American College of Rheumatology (ACR) criteria for RA

Entity relations:
- Has_qualifier("RA", "1987 American College of Rheumatology (ACR) criteria")